participant in other trial

The above is a clinical trial exclusion criterion. Annotated with entity spans:
[Competing_trial: participant in other trial]